Clinical trial exclusion criterion:
Patients with known allergies to materials of bovine origin.

Annotated entities:
- Condition: "allergies"
- Drug: "materials of bovine origin"